Clinical trial exclusion criterion:
Concurrent anti-inflammatory therapy, including corticosteroid therapy

Entity relations:
- multi("anti-inflammatory therapy", "anti-inflammatory")
- multi("corticosteroid therapy", "corticosteroid")
- Subsumes("anti-inflammatory therapy", "corticosteroid therapy")
- Has_temporal("anti-inflammatory therapy", "Concurrent")